¿Qué efecto tendría sobre la cromatina neutralizar la carga positiva de las histonas?:
1. El ADN cambiaría de carga.
2. Las histonas se uniría n más estrechamente al ADN.
3. El ADN se superenrrollaría.
4. Las histonas se separarían del ADN.
5. Las histonas se agruparían entre sí.

Respuesta correcta: 4. Las histonas se separarían del ADN.